Clinical trial exclusion criterion:
Patients with hepatopulmonary syndrome.

Annotated entities:
- Condition: "hepatopulmonary syndrome"